Clinical trial inclusion criterion:
AST/ALT: ≤ 2.5 x ULN

Annotated entities:
- Measurement: "AST/ALT"
- Value: "≤ 2.5 x ULN"